Clinical trial inclusion criterion:
Meet DSM-IV criteria for BPD as assessed by the Structured Clinical Interview for DSM-IV Personality Disorders (SCID-II).

Annotated entities:
- Condition: "BPD"
- Qualifier: "Meet DSM-IV criteria"
- Procedure: "Structured Clinical Interview for DSM-IV Personality Disorders (SCID-II)"